Clinical trial inclusion criterion:
Age: 18 to 65 years

Entity relations:
- Has_value("Age", "18 to 65 years")